Clinical trial exclusion criterion:
History of a severe seizure disorder or current anticonvulsant use.

Entity relations:
- Has_temporal("anticonvulsant", "current")
- Has_qualifier("seizure disorder", "severe")
- OR("seizure disorder", "anticonvulsant")